Clinical trial exclusion criteria:
no confirmation of the gestational age
ruptured membranes
painful regular uterine contractions
major fetal abnormalities

Annotated entities:
- Negation: "no"
- Measurement: "gestational age"
- Condition: "ruptured membranes"
- Condition: "painful regular uterine contractions"
- Qualifier: "major"
- Condition: "fetal abnormalities"